Clinical trial inclusion criterion:
Patient is hemodynamically stable, hemoglobin >10 mg/dL

Entity relations:
- Has_value("hemoglobin", ">10 mg/dL")